Clinical trial exclusion criterion:
Drug addiction, alcohol use in the amount over 2 units of alcohol a day, mental diseases.

Annotated entities:
- Condition: "Drug addiction"
- Measurement: "alcohol use"
- Value: "over 2 units of alcohol a day"
- Condition: "mental diseases"